Clinical trial exclusion criterion:
9. Relevant electrocardiograph abnormalities; bradycardia (50 bpm) or tachycardia (120 bpm) under resting conditions.

Entity relations:
- AND("electrocardiograph", "abnormalities")
- Subsumes("bradycardia", "50 bpm")
- Subsumes("tachycardia", "120 bpm")
- Has_qualifier("bradycardia", "under resting conditions")
- AND("abnormalities", "bradycardia")
- Has_qualifier("abnormalities", "Relevant")
- OR("bradycardia", "tachycardia")